Clinical trial exclusion criterion:
Patients with intercurrent infections.

Annotated entities:
- Condition: "intercurrent infections"